Clinical trial exclusion criterion:
Use of depo medroxyprogesterone within 6 months of screening

Annotated entities:
- Drug: "depo medroxyprogesterone"
- Temporal: "within 6 months of screening"